關於 Gower's sign 的敘述，下列何者正確？
A. Gower's sign 是診斷 Duchenne muscular dystrophy 的必要條件
B. 它發生在 1 歲前，至 3 歲才完全明顯
C. 有此症狀的病童一定站不起來
D. 它是一種下肢 proximal muscle weakness 的臨床表現

正確答案：D. 它是一種下肢 proximal muscle weakness 的臨床表現